Clinical trial exclusion criterion:
4. Have pulmonary edema, ascites or pitting edema on clinical examination.

Annotated entities:
- Condition: "pulmonary edema"
- Condition: "ascites"
- Condition: "pitting edema"